Clinical trial inclusion criterion:
BMI < 40;

Annotated entities:
- Measurement: "BMI"
- Value: "< 40"